胃潰瘍的疼痛由下列何者傳導？
A. 內臟大神經（greater splanchnic nerve）
B. 內臟小神經（lesser splanchnic nerve）
C. 內臟最小神經（least splanchnic nerve）
D. 迷走神經（vagus nerve）

正確答案：A. 內臟大神經（greater splanchnic nerve）